Clinical trial exclusion criterion:
Pregnant or nursing (lactating) women.

Annotated entities:
- Condition: "Pregnant"
- Observation: "nursing"
- Observation: "lactating"
- Person: "women"